Clinical trial inclusion criterion:
GIS score of at least 6.

Annotated entities:
- Measurement: "GIS score"
- Value: "at least 6"